Clinical trial inclusion criterion:
Kindergarteners who have joined our outreach dental service will be invited to join this study. Preschool children aged 3-4 years who have tooth decay and are attending the first year of kindergarten will be invited to join this study.

Annotated entities:
- Person: "Kindergarteners"
- Person: "Preschool children"
- Person: "aged"
- Value: "3-4 years"
- Condition: "tooth decay"